Clinical trial exclusion criterion:
Pathologically altered blood pH, or oxygen saturation, or carbon dioxide unless corrected prior to the start of study treatment

Entity relations:
- Has_value("blood pH", "Pathologically altered")
- OR("blood pH", "carbon dioxide", "oxygen saturation")